Clinical trial exclusion criterion:
Renal, hepatic, gastrointestinal, or biliary disorder that could impair absorption, metabolism or excretion of orally administered medication

Annotated entities:
- Qualifier: "Renal"
- Qualifier: "hepatic"
- Qualifier: "gastrointestinal"
- Qualifier: "biliary"
- Condition: "disorder"
- Condition: "impair absorption"
- Condition: "impair metabolism"
- Condition: "impair excretion"
- Drug: "orally administered medication"